Clinical trial exclusion criterion:
Previously documented evidence of Pure Red Cell Aplasia (PRCA)

Annotated entities:
- Condition: "Pure Red Cell Aplasia"
- Condition: "PRCA"